A history of suicidal ideation and behaviour, including self-harm and/or harm to others.

The above is a clinical trial exclusion criterion. Annotated with entity spans:
A history of [Condition: suicidal ideation] and behaviour, including [Condition: self-harm] and/or [Condition: harm to others].